Clinical trial inclusion criterion:
Best corrected visual acuity (BCVA) of 20/50 to 20/320 ETDRS equivalent (65 letters to 23 letters) in the study eye, with BCVA decrement primarily attributable to DME.

Annotated entities:
- Measurement: "Best corrected visual acuity (BCVA)"
- Value: "20/50 to 20/320 ETDRS equivalent"
- Value: "65 letters to 23 letters"
- Qualifier: "in the study eye"
- Non-representable: "with BCVA decrement primarily attributable to DME"